Clinical trial exclusion criterion:
Participation in other clinical trials within 3 months to the enrollment in this study.

Annotated entities:
- Competing_trial: "Participation in other clinical trials within 3 months to the enrollment in this study."